placental pathologies

The above is a clinical trial exclusion criterion. Annotated with entity spans:
[Condition: placental pathologies]